Clinical trial exclusion criterion:
Hormone therapy < 7 days prior to randomization.

Entity relations:
- Has_index("< 7 days prior to randomization", "randomization")